Which brain tumors does neuroligin-3 promote?

Neuroligin-3 promotes the growth of high-grade gliomas.